Clinical trial inclusion criterion:
scheduled for elective cesarean section.

Entity relations:
- Has_qualifier("cesarean section", "elective")
- Has_mood("cesarean section", "scheduled for")